Clinical trial exclusion criterion:
Pregnant or lactating female and female of childbearing potential.

Annotated entities:
- Condition: "Pregnant"
- Condition: "lactating"
- Person: "female"
- Condition: "childbearing potential"
- Person: "female"